Clinical trial exclusion criterion:
Prior treatment with more than 6 cycles of traditional alkylating agent-based chemotherapy regimens

Annotated entities:
- Procedure: "treatment"
- Temporal: "Prior"
- Procedure: "chemotherapy regimens"
- Qualifier: "alkylating agent-based"
- Value: "more than 6 cycles"